Clinical trial exclusion criterion:
Primary valvular disease

Annotated entities:
- Condition: "Primary valvular disease"